下列何者是機械性瓣膜（mechanical prosthesis）和半生物性瓣膜（bioprosthesis）相比較時，前者的最大優點？
A. 須長期服用抗凝血劑
B. 耐用性高（durability）
C. 對細菌感染抵抗力強
D. 較不會產生溶血

正確答案：B. 耐用性高（durability）